Clinical trial inclusion criterion:
No prior antibiotic treatment

Entity relations:
- Has_temporal("antibiotic treatment", "prior")
- Has_negation("antibiotic treatment", "No")